抗黴菌藥物 terbinafine 之作用機轉為抑制下列何者之生成？
A. 蛋白質
B. 核酸
C. 麥角固醇（ergosterol）
D. β-聚葡萄糖（β-glucan）

正確答案：C. 麥角固醇（ergosterol）